Clinical trial exclusion criteria:
patients who do not wish to participate in the project;
patients with ectopic pregnancy;
patients with comorbidities (heart failure congestive, chronic obstructive pulmonary disease);
patients with hypovolemic shock;
patients with cervical incompetence;
patients with infected miscarriage/abortion (presence of fever, pus from the cervix, leukocytosis [> 14000]);
patients with twin pregnancy;
patients with Marfan syndrome;
patients allergic to misoprostol;
patients with coagulopathy;
patients with opening of cervical internal os (4 mm of dilatation at the time of consultation);
patients with previous surgery of the cervix (conization);
patients with concomitant use of IUDs.

Annotated entities:
- Post-eligibility: "patients who do not wish to participate in the project"
- Condition: "ectopic pregnancy"
- Condition: "comorbidities"
- Condition: "heart failure congestive"
- Condition: "chronic obstructive pulmonary disease"
- Condition: "hypovolemic shock"
- Condition: "cervical incompetence"
- Qualifier: "infected"
- Condition: "abortion"
- Condition: "miscarriage"
- Condition: "fever"
- Condition: "pus from the cervix"
- Measurement: "leukocytosis"
- Temporal: "> 14000"
- Qualifier: "twin"
- Condition: "pregnancy"
- Condition: "Marfan syndrome"
- Condition: "allergic"
- Drug: "misoprostol"
- Condition: "coagulopathy"
- Observation: "opening of cervical internal os"
- Value: "4 mm of dilatation"
- Procedure: "surgery"
- Qualifier: "cervix"
- Procedure: "conization"
- Drug: "IUDs"